Clinical trial exclusion criterion:
History of immunologically mediated disease (e.g., inflammatory bowel disease, idiopathic thrombocytopenic purpura, lupus erythematosus, autoimmune hemolytic anemia, scleroderma, severe psoriasis, rheumatoid arthritis).

Annotated entities:
- Condition: "inflammatory bowel disease"
- Condition: "immunologically mediated disease"
- Condition: "idiopathic thrombocytopenic purpura"
- Condition: "lupus erythematosus"
- Condition: "autoimmune hemolytic anemia"
- Condition: "scleroderma"
- Qualifier: "severe"
- Condition: "psoriasis"
- Condition: "rheumatoid arthritis"